6. History of pneumonitis or interstitial lung disease.

The above is a clinical trial exclusion criterion. Annotated with entity spans:
[Parsing_Error: 6.] [Temporal: History] of [Condition: pneumonitis] or [Condition: interstitial lung disease].